Clinical trial inclusion criteria:
Elective surgery for thoracic aneurysm

Annotated entities:
- Procedure: "Elective surgery"
- Condition: "thoracic aneurysm"